Hombre de 28 años de profesión violinista, que consulta por haber presentado en los últimos 3 meses crisis de pánico durante sus actuaciones públicas. Las crisis se acompañan de intenso miedo a quedar bloqueado y no poder continuar con la actuación, algo que sería humillante para él. Este miedo le ha hecho cancelar sus próximas actuaciones. En el resto de sus actividades diarias no experimenta este temor, ni tampoco le sucede cuando ensaya con sus compañeros de la orquesta. ¿Qué diagnóstico consideraría más probable para este caso?
1. Fobia simple.
2. Trastorno de pánico.
3. Fobia social de ejecución.
4. Trastorno de ansiedad generalizada.
5. Agorafobia.

Respuesta correcta: 3. Fobia social de ejecución.